Clinical trial exclusion criterion:
Heart failure NYHA III to IV

Entity relations:
- Has_value("NYHA", "III to IV")
- AND("Heart failure", "NYHA")